Clinical trial exclusion criterion:
Stage 4 or 5 chronic kidney disease (eGFR< 30ml/min/1.73m2),

Entity relations:
- Has_qualifier("chronic kidney disease", "Stage 4 or 5")
- Has_value("eGFR", "< 30ml/min/1.73m2")
- Subsumes("chronic kidney disease", "eGFR")